Clinical trial inclusion criterion:
Subject has curettage for retained product after second trimester abortion

Annotated entities:
- Procedure: "curettage"
- Procedure: "abortion"
- Qualifier: "second trimester"
- Condition: "retained product"